Clinical trial exclusion criterion:
Psychotic depression by DSM-IV, i.e., presence of delusions with a SCID-R score higher than 2;

Entity relations:
- Has_value("SCID-R score", "higher than 2")
- Has_qualifier("Psychotic depression", "DSM-IV")
- AND("Psychotic depression", "delusions")
- AND("Psychotic depression", "SCID-R score")